食道閉鎖較少合併下列何種異常？
A. 無脾症（asplenism）
B. 脊椎異常（vertebral anomaly）
C. 先天性心臟病（congenital heart disease）
D. 肛門直腸異常（anorectal malformation）

正確答案：A. 無脾症（asplenism）